Clinical trial inclusion criterion:
Estimated life expectancy = 6 months.

Entity relations:
- Has_value("Estimated life expectancy", "= 6 months")